¿Qué compuesto se obtiene mayoritariamente al tratar un alcohol primario con dicromato de sodio?:
1. Un ácido carboxílico.
2. Una cetona.
3. Un éster carboxílico.
4. Un éter.

Respuesta correcta: 1. Un ácido carboxílico.